Clinical trial exclusion criterion:
Previous cervical ripening agents (cytotec, cervidil, cervical Foley Balloon)

Entity relations:
- Has_temporal("cervical ripening agents", "Previous")
- Subsumes("cervical ripening agents", "cytotec")
- OR("cytotec", "cervidil", "cervical Foley Balloon")